Clinical trial exclusion criterion:
Stroke when meeting criteria for total anterior, partial anterior or posterior circulation infarct according to the Oxford Community Stroke Project classification. Patients with clinically silent of lacunar strokes and transient ischemic attacks will not be excluded.

Annotated entities:
- Condition: "Stroke"
- Condition: "circulation infarct"
- Qualifier: "posterior"
- Qualifier: "total anterior"
- Qualifier: "partial anterior"
- Measurement: "Oxford Community Stroke Project classification"
- Non-representable: "Patients with clinically silent of lacunar strokes and transient ischemic attacks will not be excluded."